Current use of Triptans (5HT1 Agonists)

The above is a clinical trial exclusion criterion. Annotated with entity spans:
Current use of [Drug: Triptans] ([Drug: 5HT1 Agonists])